Clinical trial exclusion criterion:
History of alcohol or drug abuse or dependence within 1 month prior to study entry

Annotated entities:
- Temporal: "History"
- Condition: "abuse alcohol"
- Condition: "drug abuse"
- Condition: "dependence alcohol"
- Condition: "dependence drug"
- Temporal: "within 1 month prior"